Tuberculosis resistant to any of the study drugs (isoniazid, rifampin, EMB, PZA, CFZ, Pto)

The above is a clinical trial exclusion criterion. Annotated with entity spans:
[Condition: Tuberculosis] [Qualifier: resistant to] any of the [Drug: study drugs] ([Drug: isoniazid], [Drug: rifampin], [Drug: EMB], [Drug: PZA], [Drug: CFZ], [Drug: Pto])